Clinical trial exclusion criterion:
Uncontrolled asthma;

Entity relations:
- Has_qualifier("asthma", "Uncontrolled")